有關IgA nephropathy的敘述，下列何者錯誤？
A. 可能有家族的集群性（familial clustering）
B. 有些病童在發病後的15～20年可能會進展到慢性腎病或腎衰竭
C. 因為會復發，進入末期腎病後不建議腎移植
D. 血中IgA值並沒有診斷價值，因為只有部分的病童會升高

正確答案：C. 因為會復發，進入末期腎病後不建議腎移植